在針對癌症治療之免疫療法上，下列藥物何者主要以單株抗體抑制腫瘤細胞表面PD-L1並能干擾T淋巴細胞內
A. atezolizumab
B. panitumumab
C. ramucirumab
D. rituximab

正確答案：A. atezolizumab